Clinical trial exclusion criteria:
Age <18 years old
Patient unable to communicate or to understand the study
Patient refusing to participate to the study
contraindication to laparoscopy

Annotated entities:
- Person: "Age"
- Value: "<18 years old"
- Post-eligibility: "Patient unable to communicate or to understand the study"
- Post-eligibility: "Patient refusing to participate to the study"
- Condition: "contraindication"
- Procedure: "laparoscopy"